造成不孕症的原因，下列何者相對上發生不孕症狀的比率較少？
A. 排卵障礙
B. 輸卵管阻塞
C. 子宮肌瘤
D. 男性因素

正確答案：C. 子宮肌瘤